Clinical trial exclusion criterion:
Hemoglobin <8 or diagnosed with anemia

Annotated entities:
- Measurement: "Hemoglobin"
- Value: "<8"
- Condition: "anemia"